Clinical trial inclusion criterion:
No periodontitis (Community Periodontal Index score = 0).

Entity relations:
- Has_negation("periodontitis", "No")
- Has_value("Community Periodontal Index score", "= 0")
- Subsumes("periodontitis", "Community Periodontal Index score")